Clinical trial exclusion criterion:
Treatment with insulin

Entity relations:
- AND("Treatment", "insulin")